Caffeine use exceeding 5 cups of coffee per day or its equivalent;

The above is a clinical trial exclusion criterion. Annotated with entity spans:
[Non-query-able: Caffeine use exceeding 5 cups of coffee per day or its equivalent];